Clinical trial exclusion criterion:
Subject has been diagnosed with active hepatitis, AIDS, or HIV.

Annotated entities:
- Condition: "hepatitis"
- Condition: "AIDS"
- Condition: "HIV"
- Qualifier: "active"